Clinical trial inclusion criterion:
Subjects with healthy eyes

Annotated entities:
- Condition: "healthy eyes"